Clinical trial exclusion criterion:
contra-indication to inhalational induction (full stomach)

Entity relations:
- Has_qualifier("inhalational induction", "full stomach")
- AND("contra-indication", "inhalational induction")